Clinical trial exclusion criterion:
Any condition that in the opinion of the investigator may interfere with adherence to trial protocol

Annotated entities:
- Non-query-able: "Any condition that in the opinion of the investigator may interfere with adherence to trial protocol"